El número de señales en el espectro de RMN de 13 C del cis-1,2 dimetilciclopentano con desacoplamiento de protón es:
1. Tres.
2. Cuatro.
3. Cinco.
4. Seis.
5. Siete.

Respuesta correcta: 2. Cuatro.